Si tras sembrar 200 microlitros de una dilución 10-4 (10 exp. -4) de un caldo sobre placa de agar crecen 100 colonias, el número estimado de unidades formadoras de colonias por mL de caldo es:
1. 0,2 x 104.
2. 2 x 106.
3. 5 x 104.
4. 5 x 105.
5. 5 x 106.

Respuesta correcta: 5. 5 x 106.